下列何種狀況不會增加顯影劑誘發之急性腎小管壞死的危險性？
A. 多發性骨髓瘤（multiple myeloma）
B. 糖尿病
C. 體液不足（hypovolemia）
D. 高血鉀

正確答案：D. 高血鉀